Clinical trial exclusion criterion:
Use of a non-prescription drug and herbal substances during the study (through the Final Study Visit). The last dose of any non-prescription drug must have been taken greater than 5 half-lives for that drug before receiving study drug.

Annotated entities:
- Drug: "non-prescription drug"
- Drug: "herbal substances"
- Temporal: "during the study"
- Grammar_Error: "and"
- Drug: "any non-prescription drug"
- Temporal: "greater than 5 half-lives before receiving study drug"
- Context_Error: "any non-prescription drug"